Clinical trial inclusion criterion:
No prior radiation therapy for at least 4 weeks before enrollment in the study

Entity relations:
- Has_temporal("radiation therapy", "at least 4 weeks before enrollment")
- Has_temporal("radiation therapy", "prior")
- Has_negation("radiation therapy", "No")
- Has_index("at least 4 weeks before enrollment", "enrollment")